Clinical trial exclusion criterion:
Cases of rectal tumours below 12cm from anal verge, or locally advanced tumours invading blood vessels, nerves or bone.

Entity relations:
- Has_qualifier("rectal tumours", "below 12cm from anal verge")
- AND("locally advanced tumours", "invading blood vessels")
- OR("invading blood vessels", "bone invading", "nerves invading")
- OR("rectal tumours", "locally advanced tumours")